Clinical trial exclusion criterion:
Participant has a history of or current liver or renal insufficiency; significant cardiac, vascular, pulmonary, gastrointestinal, endocrine, neurologic, hematologic, rheumatologic, psychiatric, or metabolic disturbances

Entity relations:
- Has_qualifier("cardiac disturbances", "significant")
- Has_temporal("liver insufficiency", "history")
- OR("liver insufficiency", "cardiac disturbances", "renal insufficiency")
- OR("cardiac disturbances", "endocrine disturbances", "hematologic disturbances", "gastrointestinal disturbances", "vascular disturbances", "rheumatologic disturbances", "neurologic disturbances", "psychiatric disturbances", "metabolic disturbances", "pulmonary disturbances")